Clinical trial exclusion criterion:
3. History or diagnosis of any significant medical conditions: Including but not limited to gastrointestinal, hepatic, renal, respiratory, cardiovascular, metabolic, immunologic, hematological, psychiatric, neurological, oncological or hormonal disorders

Annotated entities:
- Parsing_Error: "3."
- Condition: "medical conditions"
- Condition: "hormonal disorders"
- Condition: "oncological disorders"
- Condition: "neurological disorders"
- Condition: "psychiatric disorders"
- Condition: "hematological disorders"
- Condition: "immunologic disorders"
- Condition: "metabolic disorders"
- Condition: "cardiovascular disorders"
- Condition: "respiratory disorders"
- Condition: "renal disorders"
- Condition: "hepatic disorders"
- Condition: "gastrointestinal disorders"
- Qualifier: "significant"
- Subjective_judgement: "significant"